What are the current treatments for generalised anxiety disorder in teenagers?

Cognitive-behavioral treatment (CBT) - both in individual and in group treatment
Randomised, placebo controlled trials have found Sertraline efficacious for GAD in adults, children and adolescents.
While both CBT and SSRIs are beneficial, some evidence suggests that the effects of CBT may be more long lasting.